Clinical trial exclusion criterion:
Patients with kyphoplasty cement or hardware that would preclude effective catheter placement.

Entity relations:
- Has_qualifier("kyphoplasty cement", "preclude effective catheter placement")
- OR("kyphoplasty cement", "kyphoplasty hardware")